Clinical trial exclusion criterion:
5. History of major head trauma;

Annotated entities:
- Parsing_Error: "5."
- Condition: "major head trauma"
- Temporal: "History"